下列口服降血糖藥，何種最可能引起維生素B12缺乏？
A. biguanides
B. acarbose
C. thiazolidinediones
D. sulfonylureas

正確答案：A. biguanides